Surgical sterilized female patients with documentation of prior hysterectomy, tubal ligation or complete bilateral oophorectomy OR

The above is a clinical trial inclusion criterion. Annotated with entity spans:
[Pregnancy_considerations: Surgical sterilized female patients with documentation of prior hysterectomy, tubal ligation or complete bilateral oophorectomy OR]